下列何種心音比較不會出現在心房中膈缺損（Atrial septal defect, ASD）的病患？
A. 寬且固定的第二心音分裂（Wide and fixed splitting of second heart sound）
B. 左側第二肋間出現噴射性收縮期的心雜音（Ejection systolic murmur）
C. 左下胸骨邊緣出現中期舒張期的心雜音（Mid-diastolic murmur）
D. 巨大且分裂的第一心音（Loud and splitting of first heart sound）

正確答案：D. 巨大且分裂的第一心音（Loud and splitting of first heart sound）